Which signaling pathway does sonidegib inhibit?

Sonidegib is a Hedghog signalling pathway inhibitor.